肥胖是脂肪過多的疾病，關於脂肪組織之脂肪代謝，下列敘述何者錯誤？
A. 脂肪組織脂肪分解，釋放出來的脂肪酸，可供給其他組織產生能量
B. 脂肪組織脂肪分解，分解出來的脂肪酸，大部分仍在脂肪組織內合成三酸甘油脂
C. 脂肪組織脂肪分解，釋放出來的脂肪酸可送到肝臟內再合成三酸甘油脂，所以肥胖病患易合併脂肪肝
D. 空腹時，釋放出來的脂肪酸送到肝臟內合成三酸甘油脂，包裝成乳糜微粒（Chylomicron）分泌至血液中

正確答案：D. 空腹時，釋放出來的脂肪酸送到肝臟內合成三酸甘油脂，包裝成乳糜微粒（Chylomicron）分泌至血液中